Any other reason the investigator deems subject is unfit for participation in the study

The above is a clinical trial exclusion criterion. Annotated with entity spans:
[Non-query-able: Any other reason the investigator deems subject is unfit for participation in the study]